Clinical trial inclusion criterion:
gestational age between 20 weeks and 23 weeks and 6 days

Entity relations:
- Has_value("gestational age", "between 20 weeks and 23 weeks and 6 days")